Clinical trial exclusion criterion:
FibroScan within 12 months demonstrating liver stiffness of =9.5 kilo Pascal or

Annotated entities:
- Procedure: "FibroScan"
- Temporal: "within 12 months"
- Measurement: "liver stiffness"
- Value: "=9.5 kilo Pascal"